Signed consent

The above is a clinical trial inclusion criterion. Annotated with entity spans:
[Informed_consent: Signed consent]